En general, los enzimas alostéricos:
1. Se unen a los efectores en el centro activo.
2. Forman enlaces covalentes con sus efectores negativos.
3. Originan curvas hiperbólicas de velocidad frente a concentración de sustrato.
4. Cambian de conformación cuando se unen a los efectores.
5. Se modifican irreversiblemente cuando son inhibidos.

Respuesta correcta: 4. Cambian de conformación cuando se unen a los efectores.